全身麻醉期間使用氣管內管（endotracheal tube），應以壓力計測量其cuff pressure，並應保持下列何者合理壓力，以預防病人吸入胃液與附近組織缺血？
A. 18 cmH2O
B. 28 cmH O
C. 38 cmH2O
D. 48 cmH2O

正確答案：B. 28 cmH O